List available tools for genomic visualisation in comparative genomics

Insyght, Genomicus and Sockeye.